Active opportunistic infections

The above is a clinical trial exclusion criterion. Annotated with entity spans:
[Qualifier: Active] [Condition: opportunistic infections]